Clinical trial exclusion criteria:
Moderate or severe endometriosis.
Hydrosalpinx.
Uterine abnormalities.
Myoma.
Previous uterine surgery.

Annotated entities:
- Qualifier: "Moderate"
- Qualifier: "severe"
- Condition: "endometriosis"
- Condition: "Hydrosalpinx"
- Condition: "Uterine abnormalities"
- Condition: "Myoma"
- Temporal: "Previous"
- Procedure: "uterine surgery"